Señale la opción FALSA. El modelo de los cinco factores de la personalidad de McCrae y Costa establece como dimensiones básicas para estudiar a la persona:
1. Neuroticismo y estabilidad emocional.
2. Extraversión e introversión.
3. Apertura mental y estrechez de miras.
4. Amabilidad y antipatía.
5. Felicidad y tristeza.

Respuesta correcta: 5. Felicidad y tristeza.